Clinical trial exclusion criterion:
Lower respiratory tract infection within the 4 weeks prior to Visit 1 .

Entity relations:
- Has_index("within the 4 weeks prior to Visit 1", "Visit 1")
- Has_temporal("Lower respiratory tract infection", "within the 4 weeks prior to Visit 1")